Clinical trial inclusion criterion:
Age 18 years or above

Entity relations:
- Has_value("Age", "18 years or above")